Clinical trial exclusion criteria:
History of constipation
Pre-existing use of narcotics or opioids
Pre-existing renal or hepatic failure
Mental illness, mental retardation, or inability to participate in informed consent due to mental status
Pre-existing dementia
Allergy to any protocol medication
Emergency operation
Subjects who are incarcerated or wards of the state
Minors
Subjects with inflammatory bowel disease, active colitis, or pre-existing intra-abdominal inflammation. Diverticulitis without active infection/inflammation will not be excluded.

Annotated entities:
- Condition: "constipation"
- Drug: "narcotics"
- Drug: "opioids"
- Temporal: "Pre-existing"
- Condition: "hepatic failure"
- Temporal: "Pre-existing"
- Condition: "renal failure"
- Condition: "Mental illness"
- Condition: "mental retardation"
- Condition: "inability to participate in informed consent"
- Condition: "mental status"
- Condition: "dementia"
- Temporal: "Pre-existing"
- Condition: "Allergy"
- Procedure: "operation"
- Qualifier: "Emergency"
- Non-representable: "Subjects who are incarcerated or wards of the state"
- Person: "Minors"
- Condition: "inflammatory bowel disease"
- Condition: "colitis"
- Temporal: "active"
- Condition: "intra-abdominal inflammation"
- Temporal: "pre-existing"
- Condition: "Diverticulitis"
- Temporal: "active"
- Condition: "infection"
- Condition: "inflammation"
- Negation: "not be excluded"
- Negation: "without"